一位 25 歲女性，G1P0，月經規則，週期 42 天，最後一次月經的第一天是 3 月 8 日。她的預產期是那一天？
A. 同年 12 月 15 日
B. 翌年 12 月 15 日
C. 同年 11 月 15 日
D. 同年 12 月 29 日

正確答案：D. 同年 12 月 29 日